Clinical trial exclusion criterion:
Affected by systemic diseases recognized to severely affect bone metabolism (e.g. Cushing's syndrome, Addison's disease, diabetes mellitus type 1, leukaemia, pernicious anaemia, malabsorption syndromes, chronic liver disease, rheumatoid arthritis).

Annotated entities:
- Condition: "Cushing's syndrome"
- Condition: "Addison's disease"
- Condition: "diabetes mellitus type 1"
- Condition: "leukaemia"
- Condition: "pernicious anaemia"
- Condition: "malabsorption syndromes"
- Condition: "chronic liver disease"
- Condition: "rheumatoid arthritis"